Clinical trial inclusion criterion:
Age greater than or equal to 18 years of age

Entity relations:
- Has_value("Age", "greater than or equal to 18 years")